Clinical trial exclusion criterion:
Substantial suicidality in a patient requiring admission but refuses to do so, and signs an "against medical advice" release form as part of clinical evaluation, and does not answer the terms for involuntary admission.

Entity relations:
- Has_qualifier("suicidality", "Substantial")
- AND("suicidality", "admission")